Clinical trial exclusion criterion:
The aged patients with bad heart and lung function.

Annotated entities:
- Person: "aged"
- Condition: "bad heart function"
- Condition: "bad lung function"